Kindergarteners who have joined our outreach dental service will be invited to join this study. Preschool children aged 3-4 years who have tooth decay and are attending the first year of kindergarten will be invited to join this study.

The above is a clinical trial inclusion criterion. Annotated with entity spans:
[Person: Kindergarteners] who have joined our outreach dental service will be invited to join this study. [Person: Preschool children] [Person: aged] [Value: 3-4 years] who have [Condition: tooth decay] and are attending the first year of kindergarten will be invited to join this study.